Clinical trial inclusion criterion:
Written informed consent obtained from the subject prior to performing any study specific procedure.

Annotated entities:
- Observation: "Written informed consent"
- Procedure: "study specific procedure"
- Temporal: "prior to performing any study specific procedure"
- Reference_point: "performing any study specific procedure"